Clinical trial exclusion criterion:
significant medical or neurological conditions

Annotated entities:
- Post-eligibility: "significant medical or neurological conditions"